uncontrolled hypertension (> 180/100 mmHg)

The above is a clinical trial exclusion criterion. Annotated with entity spans:
[Condition: uncontrolled hypertension] ([Value: > 180/100 mmHg])